Clinical trial inclusion criterion:
Completion of screening visit where ovulation will be assessed with blood draw for progesterone level (must be 5ng/mL or greater)

Entity relations:
- Has_value("progesterone level", "5ng/mL or greater")